History of autoimmune hepatitis

The above is a clinical trial exclusion criterion. Annotated with entity spans:
History of [Condition: autoimmune hepatitis]